Clinical trial exclusion criterion:
Patients receiving injection to treatment knee within 2 months of study enrollment

Entity relations:
- Has_index("within 2 months of study enrollment", "study enrollment")
- Has_qualifier("injection", "knee")